關於天使塵（phencyclidine）的敘述，下列何者錯誤？
A. 有解離性麻醉的作用
B. 作用的機轉類似搖頭丸（3,4-methylene-dioxymethamphetamine, MDMA）
C. 中毒症狀可能呈現極度焦慮
D. 天使塵中毒可以考慮用活性炭洗胃，並不建議酸化尿液幫助排除

正確答案：B. 作用的機轉類似搖頭丸（3,4-methylene-dioxymethamphetamine, MDMA）